Clinical trial inclusion criterion:
1) age 50-70

Entity relations:
- Has_value("age", "50-70")